下列有關內頸及外頸動脈（internal and external carotid arteries）血液供應之敘述，何者錯誤？
A. 供應鼻腔黏膜之血液來自內頸及外頸動脈
B. 供應上臼齒之血液來自外頸動脈
C. 供應硬腦膜之血液來自內頸及外頸動脈
D. 內頸動脈之血液不供應頭皮

正確答案：D. 內頸動脈之血液不供應頭皮